For which disease is sutezolid developed?

Sutezolid is being developed as a treatment against tuberculosis.